What is the 3D tomography imaging technique for diagnosis of  eye disease?

Currently, eye care professionals use optical coherence tomography (OCT) scans to help diagnose eye conditions.